Clinical trial inclusion criterion:
traumatic spinal cord injury at least one year ago

Entity relations:
- Has_temporal("traumatic spinal cord injury", "at least one year ago")